Computational tools for predicting allosteric pathways in proteins

We find that CARDS captures allosteric communication between the two cAMP-Binding Domains (CBDs)Overall, it is demonstrated that the communication pathways could be multiple and intrinsically disposed, and the MC path generation approach provides an effective tool for the prediction of key residues that mediate the allosteric communication in an ensemble of pathways and functionally plausible residuesWe utilized a data set of 24 known allosteric sites from 23 monomer proteins to calculate the correlations between potential ligand-binding sites and corresponding orthosteric sites using a Gaussian network model (GNM)Here, we introduce the Correlation of All Rotameric and Dynamical States (CARDS) framework for quantifying correlations between both the structure and disorder of different regions of a proteinWe present a novel method, "MutInf", to identify statistically significant correlated motions from equilibrium molecular dynamics simulationsCorrSite identifies potential allosteric ligand-binding sites based on motion correlation analyses between cavities.Here, a Monte Carlo (MC) path generation approach is proposed and implemented to define likely allosteric pathways through generating an ensemble of maximum probability paths.